Clinical trial exclusion criterion:
Patients with a supratheraputic (>3.0) INR

Entity relations:
- Subsumes("supratheraputic", ">3.0")
- Has_value("INR", "supratheraputic")